一位 55 歲男性病人為慢性 B 型肝炎帶原者，最近腹部電腦斷層及血管攝影發現肝右葉有一 2 公分大小的腫瘤，高度懷疑為肝癌，血清胎兒蛋白為 420 ng/mL，Child-Pugh 分類為 A，其他影像檢查並未有腫瘤轉移情形，你最不考慮採用下列何種治療？
A. 外科手術切除
B. 酒精注射治療
C. Radiofrequency ablation
D. Systemic chemotherapy

正確答案：D. Systemic chemotherapy